Myasthenia gravis

The above is a clinical trial exclusion criterion. Annotated with entity spans:
[Condition: Myasthenia gravis]